Clinical trial inclusion criterion:
Idiopathic Parkinson's disease ( Hughes AJ et al. 2001)

Annotated entities:
- Condition: "Parkinson's disease"
- Qualifier: "Idiopathic"